Clinical trial exclusion criterion:
Patients with a diagnosis of glaucoma

Annotated entities:
- Condition: "glaucoma"